hormone ablation for 2 months prior to treatment or during treatment

The above is a clinical trial exclusion criterion. Annotated with entity spans:
[Procedure: hormone ablation] [Temporal: for 2 months prior to treatment] or [Temporal: during treatment]